acute coronary syndrome

The above is a clinical trial exclusion criterion. Annotated with entity spans:
[Condition: acute coronary syndrome]